內斜視（esotropia）常與下列何種屈光異常有關？
A. 近視（myopia）
B. 遠視（hypermetropia）
C. 老花（presbyopia）
D. 散光（astigmatism）

正確答案：B. 遠視（hypermetropia）